Clinical trial exclusion criterion:
Currently participate in a resistance training or high impact weight bearing exercise program two or more times weekly

Entity relations:
- Has_multiplier("participate in high impact weight bearing exercise", "two or more times weekly")
- Has_multiplier("participate in a resistance training", "two or more times weekly")
- OR("participate in a resistance training", "participate in high impact weight bearing exercise")